Clinical trial exclusion criterion:
Patient is unable to perform exercise testing.

Annotated entities:
- Post-eligibility: "Patient is unable to perform exercise testing"